Clinical trial inclusion criterion:
predicted ICU stay more than 7 days

Annotated entities:
- Observation: "predicted ICU stay"
- Value: "more than 7 days"
- Visit: "ICU"